下列何者是腹腔鏡膽囊切除術（laparoscopic cholecystectomy）的 major contraindication？
A. 懷孕婦女
B. Calot's triangle 無法清楚辨識
C. 腹部曾開過刀
D. 肝硬化病人

正確答案：B. Calot's triangle 無法清楚辨識